Clinical trial inclusion criterion:
Subjects must be able and willing to give written informed consent and to comply with the requirements of this study protocol

Annotated entities:
- Non-query-able: "Subjects must be able and willing to give written informed consent and to comply with the requirements of this study protocol"